Clinical trial inclusion criterion:
need mechanical ventilation for more than 2 days

Entity relations:
- Has_mood("mechanical ventilation", "need")
- Has_multiplier("mechanical ventilation", "for more than 2 days")